2. History of traumatic brain injury of sufficient severity to have resulted in medical attention (ascertained via the Ohio State University TBI Identification Questionnaire—OSU TBI-ID, and based on DoD/VA criteria)

The above is a clinical trial inclusion criterion. Annotated with entity spans:
2. [Temporal: History] of [Condition: traumatic brain injury] of [Qualifier: sufficient severity] to have resulted in medical attention (ascertained via the [Measurement: Ohio State University TBI Identification Questionnaire—OSU TBI-ID], and based on DoD/VA criteria)